白先生是64歲的成功商人，過去樂觀開朗，社交與體能十分活躍，他太太約一年前因罹癌過世，他從此鬱鬱寡歡，與唯一的兒子媳婦同住。最近兩個月來他體重減輕，更發生血尿而前來求診。你是他的泌尿科主治醫師，因此替他安排膀胱鏡與切片門診手術，1週後的病理報告證明為膀胱癌。他與兒子一同走進診間，在支開白先生後，白先生的兒子知道病情後說：「醫師拜託不要向我爸爸宣告他得了癌症，他受不了這個打擊 的。請你告訴他是膀胱發炎，多給他點希望吧！」儘管你向兒子解釋告知病情的必要，他仍堅持；你該如何
 處理？
A. 依照兒子的要求隱瞞白先生
B. 如果病人直接向你詢問，表示希望知道結果，應把病情告知他
C. 病患自己發現病情惡化時告知
D. 交付倫理委員會決定處理方式

正確答案：B. 如果病人直接向你詢問，表示希望知道結果，應把病情告知他